Clinical trial inclusion criterion:
Patients who have received at least 1 transfusion per year in the last 2 years and who are expected to have a continuing requirement (based on Investigator's judgement) during the duration of the trial

Annotated entities:
- Multiplier: "at least 1 per year"
- Temporal: "in the last 2 years"
- Procedure: "transfusion"
- Condition: "expected to have a continuing requirement"
- Temporal: "during the duration of the trial"